Clinical trial exclusion criterion:
pregnancy or non-acceptance to use anticonception measures during 13 days after debut

Annotated entities:
- Pregnancy_considerations: "pregnancy or non-acceptance to use anticonception measures during 13 days after debut"